Clinical trial exclusion criterion:
Pulmonary disorders, including COPD and asthma

Entity relations:
- Subsumes("Pulmonary disorders", "COPD")
- OR("COPD", "asthma")